Which is the main reason for the increase in the incidence of cryptococcal disease?

The incidence of infection with Cryptococcus neoformans has increased four-fold in the last decade. It is an increasing cause of infection in immunosuppressed patients, most notably those with HIV infection.